人類重組 interleukin-11 又稱為 oprelvekin，此生物性製劑主要使用於緩解化療（chemotherapy）引發之何種症狀？
A. Vomiting
B. Severe thrombocytopenia
C. Alopecia
D. Diarrhea

正確答案：B. Severe thrombocytopenia